On treatment with oral anticoagulant

The above is a clinical trial exclusion criterion. Annotated with entity spans:
On treatment with [Qualifier: oral] [Drug: anticoagulant]